The indication for oral anticoagulation, associated with others disease.

The above is a clinical trial exclusion criterion. Annotated with entity spans:
The [Mood: indication for] [Procedure: oral anticoagulation], associated with others disease.